Clinical trial exclusion criterion:
Current treatment with a dopamine agonist

Entity relations:
- Has_temporal("dopamine agonist", "Current")